Clinical trial inclusion criterion:
6. ECOG Performance Status of 0 or 1.

Annotated entities:
- Measurement: "ECOG Performance Status"
- Value: "0 or 1"